comorbid psychotic, bipolar, substance use dependence, Alzheimer's or dementia

The above is a clinical trial exclusion criterion. Annotated with entity spans:
[Temporal: comorbid] [Condition: psychotic], [Condition: bipolar], [Condition: substance use dependence], [Condition: Alzheimer's] or [Condition: dementia]